Clinical trial exclusion criterion:
Cancers other than basal cell skin cancers within the last 5 years

Annotated entities:
- Condition: "Cancers"
- Negation: "other than"
- Condition: "basal cell skin cancers"
- Temporal: "within the last 5 years"